Clinical trial inclusion criterion:
2. Subject requires single- or multi-vessel percutaneous coronary intervention (PCI) of de novo or restenotic target lesion (including in-stent restenotic lesions).

Entity relations:
- Has_qualifier("percutaneous coronary intervention (PCI)", "single- vessel")
- Has_qualifier("in-stent restenotic lesions", "restenotic")
- Has_qualifier("in-stent restenotic lesions", "in-stent")
- AND("percutaneous coronary intervention (PCI)", "target lesion")
- Has_qualifier("target lesion", "de novo")
- Subsumes("target lesion", "in-stent restenotic lesions")
- OR("single- vessel", "multi-vessel")
- OR("de novo", "restenotic")